24歲男性，兩手張開之長度較身高多兩吋，陰莖短小，無陰毛，嗅覺不佳。下列何者是此病人的檢查結果？
A. 睪丸小而軟
B. 性染色體為47XXY
C. 身材矮小，三角臉
D. 重度肥胖，智障

正確答案：A. 睪丸小而軟